Clinical trial inclusion criterion:
Patient has intraocular pressure (IOP) ≤ 20 mmHg.

Entity relations:
- Has_value("intraocular pressure (IOP)", "≤ 20 mmHg")